Clinical trial inclusion criterion:
Treatment with GLP1 (glucagon-like peptide) analogue or insulin

Entity relations:
- AND("Treatment", "GLP1 (glucagon-like peptide) analogue")
- OR("GLP1 (glucagon-like peptide) analogue", "insulin")